Clinical trial exclusion criterion:
Pregnant women or likely to be in the absence of effective contraception,

Annotated entities:
- Observation: "Pregnant"
- Person: "women"
- Mood: "likely to be"
- Observation: "Pregnant"
- Qualifier: "in the absence of effective contraception"